關於大腦皮質Brodmann area 4之敘述何者錯誤？
A. 可發出皮質脊髓徑（corticospinal tract）
B. 含貝茲細胞（Betz cell）
C. 可接受丘腦腹外側核（ventral lateral nucleus of thalamus）傳入之訊息
D. 位於後中央迴（postcentral gyrus）

正確答案：D. 位於後中央迴（postcentral gyrus）